¿Qué enzima está presente en el complejo II que participa en la fosforilación oxidativa?
1. Coenzima Q: citocromo c oxidorreductasa.
2. NADH deshidrogenasa.
3. Succinato-coenzima Q reductasa.
4. ATP sintasa.
5. Citocromo c oxidasa.

Respuesta correcta: 3. Succinato-coenzima Q reductasa.